Clinical trial inclusion criteria:
1. Males and females ≥ 18 years old.
2. Clinical diagnosis of type 1 diabetes for at least one year.
3. The subject will have been on insulin pump therapy for at least 3 months and currently using a fast actin insulin analog (Lispro, Aspart or Guilisine).
4. Last (less than 3 months) HbA1c ≤ 10%.
5. Currently using carbohydrate counting as the meal insulin dose strategy.

Annotated entities:
- Parsing_Error: "1."
- Person: "Males"
- Grammar_Error: "and"
- Person: "females"
- Person: "old"
- Value: "≥ 18 years old"
- Parsing_Error: "2."
- Condition: "type 1 diabetes"
- Temporal: "for at least one year"
- Parsing_Error: "3."
- Procedure: "insulin pump therapy"
- Temporal: "for at least 3 months"
- Temporal: "currently"
- Drug: "fast actin insulin analog"
- Drug: "Lispro"
- Drug: "Aspart"
- Drug: "Guilisine"
- Parsing_Error: "4."
- Measurement: "HbA1c"
- Value: "≤ 10%"
- Temporal: "Last (less than 3 months)"
- Parsing_Error: "5."
- Procedure: "carbohydrate counting"
- Procedure: "meal insulin dose strategy"
- Temporal: "Currently"